曉怡今年 23 歲，過去沒有內科疾病，今晨因為下腹痛來急診，臉色蒼白冒冷汗，且會有一點呼吸急促，血壓 90/60 mmHg，心跳每分鐘 100 下，她自訴過去月經不規則，不記得上次月經是什麼時候，不過這幾天有一些陰道出血，急診醫師幫她驗孕，結果出來是陽性，試問不需要下列何項檢查來輔助診斷？
A. 血液中 β-hCG 濃度
B. 經陰道超音波
C. 驗全血球計數（CBC）
D. 血中 FSH 濃度

正確答案：D. 血中 FSH 濃度